Clinical trial exclusion criterion:
4. Have pulmonary edema, ascites or pitting edema on clinical examination.

Entity relations:
- OR("pulmonary edema", "ascites", "pitting edema")